Clinical trial inclusion criterion:
Hyperkalaemia

Annotated entities:
- Condition: "Hyperkalaemia"